75 歲男性因肺癌住院治療，電腦斷層發現腫瘤轉移到兩側腎上腺，全身倦怠，血鉀上升，全身皮膚及口腔黏膜、掌紋處多處變黑，下列敘述何者正確？
A. 無法對 corticotropin stimulation test 有正常的反應，血液中 ACTH 濃度高
B. niacin 缺乏
C. 癌細胞轉移皮膚造成
D. 病人服用 epidermal growth factor receptor（EGFR）inhibitor 造成

正確答案：A. 無法對 corticotropin stimulation test 有正常的反應，血液中 ACTH 濃度高